Clinical trial exclusion criterion:
18. Cancer.

Annotated entities:
- Parsing_Error: "18."
- Condition: "Cancer"